Clinical trial inclusion criterion:
A service user of the early intervention service

Annotated entities:
- Non-query-able: "A service user of the early intervention service"